Clinical trial inclusion criterion:
Have at least one cardiovascular risk factor (eg, current smoker, high blood pressure, high cholesterol levels, diabetes mellitus, history of heart attack, family history of coronary heart disease, extra-articular RA disease)

Annotated entities:
- Multiplier: "at least one"
- Condition: "cardiovascular risk factor"
- Temporal: "current"
- Observation: "smoker"
- Condition: "high blood pressure"
- Condition: "high cholesterol levels"
- Condition: "diabetes mellitus"
- Temporal: "history"
- Condition: "heart attack"
- Observation: "family history"
- Condition: "coronary heart disease"
- Qualifier: "extra-articular"
- Condition: "RA disease"